Clinical trial exclusion criterion:
Subject in an exclusion period from another study,

Annotated entities:
- Non-query-able: "Subject in an exclusion period from another study"
- Context_Error: "Subject in an exclusion period from another study"